下列何者不是腹腔鏡手術時，二氧化碳氣腹可能造成的生理影響？
A. 呼吸性酸血症
B. 下腔大靜脈回流下降
C. 刺激迷走神經引起心跳加快
D. 尿量減少

正確答案：C. 刺激迷走神經引起心跳加快